Clinical trial exclusion criterion:
Exclusion criteria includes ICUs with an average length of stay of less than 2 days;

Annotated entities:
- Visit: "ICUs"
- Measurement: "average length of stay"
- Value: "less than 2 days"